The patients have normal cardiac functions by echocardiography.

The above is a clinical trial inclusion criterion. Annotated with entity spans:
The patients have [Condition: normal cardiac functions] by [Procedure: echocardiography].